Clinical trial exclusion criterion:
Predominant overactive bladder symptoms

Entity relations:
- Has_qualifier("overactive bladder symptoms", "Predominant")
- multi("overactive bladder symptoms", "overactive bladder")